Clinical trial exclusion criteria:
pregnancy
menopause
interstitial cystitis
irritable bowel syndrome
untreated vaginitis
cervicitis
pelvic inflammatory disease
any other pelvic pathology causing pain
concomitant physical therapy
concomitant biofeedback
concomitant massage
additional acupuncture

Annotated entities:
- Condition: "pregnancy"
- Condition: "menopause"
- Condition: "interstitial cystitis"
- Condition: "irritable bowel syndrome"
- Condition: "untreated vaginitis"
- Condition: "cervicitis"
- Condition: "pelvic inflammatory disease"
- Condition: "pelvic pathology"
- Qualifier: "causing pain"
- Undefined_semantics: "other pelvic pathology causing pain"
- Procedure: "physical therapy"
- Temporal: "concomitant"
- Temporal: "concomitant"
- Procedure: "biofeedback"
- Procedure: "massage"
- Temporal: "concomitant"
- Procedure: "acupuncture"